Relative contraindications to ECT therapy (recent MI or CVA, increased intracranial pressure, intracranial mass lesion, intracranial aneurysm, epilepsy, known cardiac arrhythmia, pheochromocytoma, pregnancy)

The above is a clinical trial exclusion criterion. Annotated with entity spans:
[Condition: Relative contraindications] to [Procedure: ECT therapy] ([Temporal: recent] [Condition: MI] or [Condition: CVA], [Value: increased] [Measurement: intracranial pressure], [Condition: intracranial mass lesion], [Condition: intracranial aneurysm], [Condition: epilepsy], known [Condition: cardiac arrhythmia], [Condition: pheochromocytoma], [Condition: pregnancy])